Clinical trial inclusion criterion:
9. Had never received an analgesic regimen that contained lidocaine or gabapentin

Annotated entities:
- Drug: "analgesic regimen"
- Drug: "lidocaine"
- Drug: "gabapentin"